關於有機磷中毒（organophosphate intoxication），下列敘述何者錯誤？
A. 常表現副交感神經亢進症狀，如瞳孔縮小、流涎及心搏過慢
B. 易產生吸入性肺炎併發症
C. atropine 為解毒劑
D. pralidoxime（PAM）可以改善肌肉顫動情形，須至少使用三個月

正確答案：D. pralidoxime（PAM）可以改善肌肉顫動情形，須至少使用三個月